What protein is the most common cause of hereditary  renal amyloidosis?

The most common cause of hereditary  renal amyloidosis is over expression of a mutant form of the Fibrinogen A Alpha protein